有關抗生素之敘述，下列何者正確？
A. 克拉維酸（Clavulanic acid）通常被單獨使用
B. 甲氧葉酸嘧啶（Trimethoprim）抑制葉酸生成
C. 紅黴素（Erythromycin）抑制細胞壁的合成
D. 磺胺（Sulfonamide）抑制DNA旋轉酶（gyrase）

正確答案：B. 甲氧葉酸嘧啶（Trimethoprim）抑制葉酸生成